Clinical trial exclusion criterion:
Currently prescribed pharmacotherapy for alcohol dependence (not including treatment of acute alcohol withdrawal syndrome)

Annotated entities:
- Condition: "alcohol dependence"
- Procedure: "pharmacotherapy"
- Temporal: "Currently"
- Negation: "not including"
- Procedure: "treatment"
- Condition: "acute alcohol withdrawal syndrome"